αβ T 細胞之抗原受器（antigen receptor）的基因重組（gene rearrangement）發生於下列那一器官？
A. 骨髓
B. 胸腺
C. 淋巴結
D. 脾臟

正確答案：B. 胸腺